Clinical trial inclusion criteria:
subjects older than 35 years
diagnosis of moderate to very severe COPD (FEV1 <80% predicted), according to the GesEPOC criteria, established at least 3 months
current or former smoker with an accumulated consumption >10 packs x year
hospital admission for COPD exacerbation

Annotated entities:
- Person: "years"
- Value: "older than 35"
- Condition: "COPD"
- Qualifier: "moderate"
- Qualifier: "very severe"
- Measurement: "FEV1"
- Value: "<80% predicted"
- Measurement: "GesEPOC criteria,"
- Temporal: "at least 3 months"
- Person: "smoker"
- Observation: "consumption"
- Multiplier: ">10 packs x year"
- Visit: "admission"
- Condition: "COPD exacerbation"